Clinical trial inclusion criterion:
RET fusion positive or FGFR2 fusion/other FGFR mutation Refractory solid tumor and/or specific sensitivity to Sunitinib by Avatar scan that has progressed following standard therapy or that has not responded to standard therapy or for which there is no standard therapy.

Entity relations:
- Has_value("RET fusion", "positive")
- Has_qualifier("solid tumor", "Refractory")
- Has_qualifier("solid tumor", "FGFR2 fusion")
- Has_qualifier("Sunitinib", "sensitivity")
- OR("FGFR2 fusion", "FGFR mutation")
- OR("RET fusion", "solid tumor", "Sunitinib")